A pesar de su fuerte reactividad, el ácido nítrico concentrado no es capaz de atacar al:
1. Cobre.
2. Mercurio.
3. Aluminio.
4. Estaño.

Respuesta correcta: 3. Aluminio.